¿Cómo se denomina la alteración formal del pensamiento en la que el paciente elabora su discurso basándose en los sonidos de las palabras y no en lo que significan?:
1. Resonancia.
2. Ilocigidad.
3. Musicalidad.
4. Paraentonación.

Respuesta correcta: 1. Resonancia.